Increase in creatinine of 15% or greater within one month (30 days) of the screening visit

The above is a clinical trial exclusion criterion. Annotated with entity spans:
[Value: Increase] in [Measurement: creatinine] of 15% or greater [Temporal: within one month] ([Temporal: 30 days]) of the screening visit